Clinical trial inclusion criterion:
9. Prior therapy with FLT3 inhibitors is permitted, except previous treatment with AC220.

Entity relations:
- AND("therapy", "FLT3 inhibitors")
- Has_mood("therapy", "permitted")
- AND("treatment", "AC220")
- Has_negation("treatment", "except")
- AND("therapy", "treatment")